Clinical trial exclusion criterion:
Presence of such complications as SBP, or hepatic encephalopathy(West Haven grade = 3)

Annotated entities:
- Condition: "complications"
- Condition: "SBP"
- Condition: "hepatic encephalopathy"
- Measurement: "West Haven grade"
- Value: "= 3"